Las aminoacil-ARNt sintetasas:
1. En conjunción con otra enzima, unen el aminoácido al ARNt.
2. Interaccionan directamente con los ribosomas libres.
3. Existen en múltiples formas para cada aminoácido.
4. Requieren GTP para activar el aminoácido.
5. “Reconocen” moléculas de ARNt específicas y aminoácidos específicos.

Respuesta correcta: 5. “Reconocen” moléculas de ARNt específicas y aminoácidos específicos.